Clinical trial exclusion criterion:
Complicating health factors precluding the use of opioids or acetaminophen

Entity relations:
- AND("Complicating health factors", "precluding")
- AND("precluding", "opioids")
- OR("opioids", "acetaminophen")